6. Use of systemic steroids within 1 month of study entry

The above is a clinical trial exclusion criterion. Annotated with entity spans:
6. Use of [Drug: systemic steroids] [Temporal: within 1 month of study entry]